小腦的齒狀核－紅核－丘腦徑（dentato-rubro-thalamic tract），行經下列何構造？
A. 上小腦腳（superior cerebellar peduncle）
B. 中小腦腳（middle cerebellar peduncle）
C. 下小腦腳（inferior cerebellar peduncle）
D. 繩狀體（restiform body）

正確答案：A. 上小腦腳（superior cerebellar peduncle）